Clinical trial exclusion criterion:
evidence of severe cardiac disease.

Annotated entities:
- Qualifier: "severe"
- Condition: "cardiac disease"
- Mood: "evidence of"